Clinical trial inclusion criterion:
1. Diagnosis of primary immunodeficiency with established plan to undergo myeloablative or non-myeloablative allogeneic hematopoietic stem cell transplant for treatment thereof or diagnosis of a form of primary immunodeficiency for which hematopoietic stem cell transplantation is not indicated.

Annotated entities:
- Parsing_Error: "1."
- Condition: "primary immunodeficiency"
- Procedure: "allogeneic hematopoietic stem cell transplant myeloablative"
- Procedure: "non-myeloablative allogeneic hematopoietic stem cell transplant"
- Condition: "primary immunodeficiency"
- Procedure: "hematopoietic stem cell transplantation"
- Negation: "not indicated"